inability to communicate in English

The above is a clinical trial exclusion criterion. Annotated with entity spans:
[Condition: inability to communicate in English]